El tiempo medio de absorción de un fármaco (MAT) coincide con su tiempo medio de residencia en el lugar de absorción (MIT) si dicho fármaco se encuentra en:
1. Una forma líquida en disolución.
2. Comprimidos de liberación inmediata.
3. Cápsulas.
4. Formas de liberación modificada.

Respuesta correcta: 1. Una forma líquida en disolución.